張先生胸部遭受撞擊，若突然併發有急性創傷後呼吸不足（pulmonary insufficiency）症狀，下列何者是最常見的原因？
A. 肺挫傷
B. 氣胸
C. 肋骨骨折
D. 成人呼吸窘迫症（ARDS）

正確答案：B. 氣胸